Clinical trial exclusion criterion:
History of malignancy including leukemia and lymphoma within recent 5 years except for localized basal cell carcinoma of the skin)

Annotated entities:
- Condition: "malignancy"
- Temporal: "History of"
- Condition: "leukemia"
- Condition: "lymphoma"
- Temporal: "within recent 5 years"
- Condition: "localized basal cell carcinoma of the skin"
- Negation: "except for"